La gluconeogénesis es activa en:
1. Cerebro y tejido nervioso.
2. Hígado y corteza renal.
3. Eritrocitos.
4. Testículos y médula renal.
5. Músculo esquelético.

Respuesta correcta: 2. Hígado y corteza renal.